心包腔（pericardial cavity）和胸膜腔（pleural cavity）的完全分隔是因原始縱膈（primitive mediastinum）和下列何者的融合所造成？
A. 胸腹膜（pleuroperitoneal membrane）
B. 胃背繫膜（dorsal mesogastrium）
C. 食道繫膜（mesoesophagus）
D. 胸心包膜（pleuropericardial membrane）

正確答案：D. 胸心包膜（pleuropericardial membrane）